Which factors drive replisome disassembly during DNA replication termination and mitosis?

CUL-2LRR-1 and UBXN-3.